Clinical trial inclusion criterion:
Bilirubin less than 1.5x upper limit of normal, AST less than 3x upper limit of normal, serum creatinine less than 1.5x normal and Hgb 8.0 g/dL or greater

Annotated entities:
- Measurement: "Bilirubin"
- Value: "less than 1.5x upper limit of normal"
- Measurement: "AST"
- Value: "less than 3x upper limit of normal"